¿Cuál de los siguientes huesos se articula, en la muñeca, con el radio?:
1. Ganchoso.
2. Grande.
3. Trapecio.
4. Escafoides.

Respuesta correcta: 4. Escafoides.